Clinical trial exclusion criterion:
Evidence or suspect of Progressive Multifocal Leukoencephalopathy (PML) in Magnetic Resonance Imaging (MRI).

Annotated entities:
- Condition: "Progressive Multifocal Leukoencephalopathy (PML)"
- Procedure: "Magnetic Resonance Imaging (MRI)"
- Mood: "Evidence"
- Mood: "suspect"